作為生物的能量儲存分子，下列何者單位乾重儲存的能量最高？
A. carbohydrates
B. proteins
C. nucleic acids
D. triacylglycerols

正確答案：D. triacylglycerols